¿Qué sucede con los parámetros cinéticos de una enzima michaeliana en presencia de un inhibidor competitivo?:
1. Vmax disminuye, Km aumenta.
2. Vmax disminuye, Km disminuye.
3. Vmax disminuye, Km no varía.
4. Vmax no varía, Km aumenta.
5. Vmax no varía, Km disminuye.

Respuesta correcta: 4. Vmax no varía, Km aumenta.